Clinical trial exclusion criterion:
Previous pacemaker implantation.

Annotated entities:
- Device: "pacemaker implantation"